一位 60 歲女性有 5 年的退化性膝關節炎，X 光顯示雙邊膝關節於承重時有內側關節腔（medial compartment）狹窄並伴隨疼痛。下列何種輔具（orthosis）對她最有幫助？
A. 鞋墊加裝外側楔形突起器（lateral wedge）
B. 足弓墊（arch support）
C. 足跟杯（heel cup）
D. 彈性繃帶（elastic bandage）

正確答案：A. 鞋墊加裝外側楔形突起器（lateral wedge）